Clinical trial exclusion criterion:
Pregnancy or breastfeeding

Annotated entities:
- Pregnancy_considerations: "Pregnancy or breastfeeding"